Clinical trial exclusion criterion:
School districts that are too difficult to reach (more than a 3-hour walk from the farthest place reachable by a four-wheel drive vehicle)

Annotated entities:
- Visit: "School districts that are too difficult to reach"
- Measurement: "walk from the farthest place reachable by a four-wheel drive vehicle"
- Value: "more than a 3-hour"